¿De qué factores depende el volumen aparente de distribución de un fármaco?:
1. De su grado de unión a las proteínas plasmáticas y tisulares y de su semivida de eliminación.
2. De su coeficiente de reparto y de su semivida de eliminación.
3. De su semivida de eliminación y de su constante de eliminación.
4. De su grado de unión a las proteínas plasmáticas y tisulares y de su coeficiente de reparto.
5. De su constante de eliminación y de su aclaramiento.

Respuesta correcta: 4. De su grado de unión a las proteínas plasmáticas y tisulares y de su coeficiente de reparto.